下列何者是粥樣動脈硬化最初發生的部位？
A. 內膜（Intima）
B. 中膜（Media）
C. 外膜（Adventitia）
D. 所有三層（all three layers）

正確答案：A. 內膜（Intima）